Clinical trial exclusion criterion:
Richter's syndrome, Burkitt's lymphoma, or Burkitt-like Lymphoma (transformed DLBCL from Follicular NHL are eligible).

Annotated entities:
- Condition: "Richter's syndrome"
- Condition: "Burkitt's lymphoma"
- Condition: "Burkitt-like Lymphoma"
- Condition: "DLBCL"
- Condition: "Follicular NHL"